Clinical trial exclusion criterion:
previous PCI in the target vessel

Annotated entities:
- Procedure: "PCI"
- Temporal: "previous"
- Qualifier: "target vessel"
- Qualifier: "target vessel"